一位 25 歲女性在生產後不久突發呼吸困難、發紺、血壓下降及休克，病人接續發生肺水腫。下列何者 不可能出現在病人的肺部微血管循環中？
A. 空氣
B. 鱗狀細胞
C. 脂肪
D. 黏液

正確答案：A. 空氣